Clinical trial exclusion criterion:
Previous therapy of PWS within the last 4 weeks;

Entity relations:
- Has_temporal("therapy", "Previous")
- Has_temporal("therapy", "within the last 4 weeks")
- AND("therapy", "PWS")